With acute diseases, such as acute phase after myocardial infarction (within 3 months), within 3 months after acute heart failure or new cerebral infarction;

The above is a clinical trial exclusion criterion. Annotated with entity spans:
With [Condition: acute diseases], such as [Temporal: acute phase] after [Condition: myocardial infarction] ([Temporal: within 3 months]), [Temporal: within 3 months] after [Condition: acute heart failure] or new [Condition: cerebral infarction];